Clinical trial exclusion criterion:
Known hypersensitivity to Brilliant Blue FCF (E133)

Entity relations:
- AND("hypersensitivity", "Brilliant Blue FCF (E133)")
- AND("hypersensitivity", "Brilliant Blue FCF (E133)")